Clinical trial exclusion criterion:
Subjects who have received live or live attenuated vaccines within 6 weeks prior to the first dose of study drug (or the zoster vaccine)

Entity relations:
- Has_multiplier("study drug", "first dose")
- multi("the first dose of study drug", "study drug")
- Has_index("within 6 weeks prior to the first dose of study drug", "the first dose of study drug")
- Has_temporal("live vaccines", "within 6 weeks prior to the first dose of study drug")
- OR("live vaccines", "live attenuated vaccines")
- OR("live vaccines", "zoster vaccine")